Clinical trial exclusion criterion:
Allergy or intolerance to clonidine

Entity relations:
- OR("Allergy", "intolerance")